下列有關腸胃道多肽類與其功能之配對，何者正確？
A. 血管活性腸多肽（vasoactive intestinal polypeptide）：促進腸上皮細胞分泌電解質
B. 胃抑肽（gastric inhibitory peptide）: 抑制迷走神經傳導
C. 移動素（motilin）：促進小腸分節運動
D. 體抑素（somatostatin）: 增加肝臟分泌體介素（somatomedin）

正確答案：A. 血管活性腸多肽（vasoactive intestinal polypeptide）：促進腸上皮細胞分泌電解質